Clinical trial exclusion criterion:
Active symptomatic urinary infection

Annotated entities:
- Qualifier: "symptomatic"
- Qualifier: "Active"
- Condition: "urinary infection"